La -talasemia puede tener su origen en:
1. El déficit de ferroquetalasa.
2. El déficit de HbA2.
3. La presencia de HBH.
4. La presencia de HbS.
5. La presencia de metahemoglobina.

Respuesta correcta: 3. La presencia de HBH.